下列何種激素不能活化脂肪組織 triacylglycerol lipase 的活性？
A. insulin
B. norepinephrine
C. adrenocorticotropic hormone
D. glucagon

正確答案：A. insulin